2. Healthy subjects aged between 18 years and 45 years inclusive

The above is a clinical trial inclusion criterion. Annotated with entity spans:
[Parsing_Error: 2.] [Condition: Healthy] subjects [Person: aged] [Value: between 18 years and 45 years inclusive]